Clinical trial exclusion criterion:
Allergies to shell fish, seafood, eggs or iodine

Annotated entities:
- Condition: "Allergies"
- Observation: "shell fish"
- Observation: "seafood"
- Observation: "eggs"
- Drug: "iodine"